對於腎臟移植後的處置，以下何者正確？①通常會使用 β-blockers，hydralazine 和 calcium channel blockers 來控制高血壓 ②nystatin（mycostatin）通常被用來預防口腔的黴菌感染 ③trimethoprim-sulfamethoxazole （baktar）被用來預防泌尿道感染和肺囊蟲肺炎（Pneumocystis carinii） ④制酸劑（antacids）被用來預防胃潰瘍 ⑤阿斯匹靈（aspirin）被用來預防動脈栓塞（arterial thrombosis）
A. ①③⑤
B. ①②④⑤
C. ②③④⑤
D. ①②③④

正確答案：D. ①②③④